Clinical trial exclusion criterion:
Conversion to laparotomy

Annotated entities:
- Observation: "Conversion to"
- Procedure: "laparotomy"